How are super enhancers defined?

The super enhancers are important for defining cell identity in mammalian developmental processes and human diseases. They are defined as genomic regions containing clusters of multiple enhancers, which regulate cell-identity genes and oncogenes. The enhancers can be identified by ChIP sequencing (ChIP-seq) to identify domains enriched for the histone marks histone H3 lysine 4 trimethylation (H3K4me3, H3k4me1, and H3K27ac) and define, for the first time, the super enhancementancers and typical enhancers active in primary human cor